Unresectable tumor during operation

The above is a clinical trial exclusion criterion. Annotated with entity spans:
[Condition: Unresectable tumor] during operation